Electrocardiographic abnormalities or organic heart diseases;

The above is a clinical trial exclusion criterion. Annotated with entity spans:
[Condition: Electrocardiographic abnormalities] or [Qualifier: organic] [Condition: heart diseases];